Clinical trial inclusion criterion:
Men or women at least 19 years of age

Entity relations:
- Has_value("age", "at least 19 years")
- OR("Men", "women")